Clinical trial inclusion criterion:
Audible abnormalities by chest examination compatible with pneumonia

Annotated entities:
- Observation: "Audible abnormalities"
- Procedure: "chest examination"
- Condition: "pneumonia"